下列何者是婦科手術後，最常見的肺部併發症（pulmonary complications）？
A. pneumothorax
B. atelectasis
C. pulmonary edema
D. bronchopneumonia

正確答案：B. atelectasis